下列有關惡性貧血（pernicious anemia）的敘述，何者正確？
A. 自體抗體攻擊十二指腸腺體所致
B. 周邊血液出現細胞變大且細胞核有超多葉的嗜中性白血球
C. 腸胃道黏膜相關淋巴癌（mucosa-associated lymphoid tumor）的重要危險因子
D. 周邊血液出現變大及淡染的卵形紅血球

正確答案：B. 周邊血液出現細胞變大且細胞核有超多葉的嗜中性白血球